8. Have a calculated creatinine clearance of >/= 60 cc/min.

The above is a clinical trial inclusion criterion. Annotated with entity spans:
8. Have a [Measurement: calculated creatinine clearance] of [Value: >/= 60 cc/min].